P-glycoprotein (P-gp) inducers (e.g., rifampin, St. John's wort)

The above is a clinical trial exclusion criterion. Annotated with entity spans:
[Drug: P-glycoprotein (P-gp) inducers] (e.g., [Drug: rifampin], [Drug: St. John's wort])